Metastatic disease (M1)

The above is a clinical trial exclusion criterion. Annotated with entity spans:
[Condition: Metastatic disease (M1)]